What does bDMARD stand for?

bDMARDs are biologic disease-modifying antirheumatic drugs.